Rifampin 為治療結核病的第一線藥物，其抑菌機轉為何？
A. 與細菌的 penicillin binding protein 結合，阻斷細菌細胞壁的合成
B. 與細菌的 30S 核糖體蛋白結合，阻斷細菌蛋白質的生成
C. 與細菌 DNA-dependent RNA polymerase 結合，阻斷細菌 RNA 合成的起始（initiation of RNA synthesis）
D. 與細菌 Dihydrofolate reductase 結合，阻斷細菌葉酸的代謝路徑

正確答案：C. 與細菌 DNA-dependent RNA polymerase 結合，阻斷細菌 RNA 合成的起始（initiation of RNA synthesis）